Clinical trial exclusion criterion:
Constrictive pericarditis

Annotated entities:
- Condition: "Constrictive pericarditis"